Females must have a urine or serum pregnancy test (Human Chorionic Gonadotropin) that is negative at Screening and Day 1

The above is a clinical trial inclusion criterion. Annotated with entity spans:
Females must have a [Measurement: urine] or [Measurement: serum pregnancy test] ([Measurement: Human Chorionic Gonadotropin]) that is [Value: negative] [Temporal: at Screening] and [Temporal: Day 1]